下列何種醣類代謝產物會影響氧分子與血紅蛋白（hemoglobin）的親和力？
A. 1,3-bisphosphoglycerate
B. 2,3-bisphosphoglycerate
C. fructose 1,6-bisphosphate
D. fructose 2,6-bisphosphate

正確答案：B. 2,3-bisphosphoglycerate